下列敘述何者錯誤？
A. 福氏內格里阿米巴（Naegleria fowleri）的患者通常為身體虛弱的老人，發病前一週曾經游泳
B. 原發性阿米巴腦膜腦炎（primary amebic meningoencephalitis）患者，如未及時診治，通  	常在症狀出現後3～6天內死亡
C. 如在患者組織切片中同時發現滋養體（trophozoites）及囊體（cysts），患者最可能是感染了棘阿米巴（Acanthamoeba spp.）
D. 棘阿米巴（Acanthamoeba spp.）也可能造成角膜炎及皮膚潰瘍

正確答案：A. 福氏內格里阿米巴（Naegleria fowleri）的患者通常為身體虛弱的老人，發病前一週曾經游泳